Clinical trial exclusion criterion:
Major depressive disorder in the last year requiring treatment

Entity relations:
- Has_temporal("Major depressive disorder", "last year")
- AND("Major depressive disorder", "treatment")